在胰臟β細胞中，下列那個酵素所催化的反應速率會隨血糖上升而明顯提高，且其下游產物能促進胰島素（insulin）的分泌？
A. glycogen synthase
B. glucokinase（或稱hexokinase IV）
C. phosphorylase kinase
D. glycogen phosphorylase

正確答案：B. glucokinase（或稱hexokinase IV）